What organism causes hepatic capillariasis?

hepatic capillariasis, caused by the parasite Capillaria hepatica,